Clinical trial exclusion criterion:
The patient is participating in another clinical study using an investigational product.

Annotated entities:
- Competing_trial: "The patient is participating in another clinical study using an investigational product"